more than mild or unstable cardiovascular disease

The above is a clinical trial exclusion criterion. Annotated with entity spans:
[Qualifier: more than mild] or [Qualifier: unstable] [Condition: cardiovascular disease]